Clinical trial exclusion criterion:
Awaiting cardiac transplantation or other cardiac surgery within the next 365 days (12 months)

Entity relations:
- Subsumes("within the next 365 days", "within 12 months")
- Has_mood("cardiac transplantation", "Awaiting")
- Has_temporal("cardiac transplantation", "within the next 365 days")
- OR("cardiac transplantation", "cardiac surgery")